下列那一項不是子宮內膜癌的危險因子？
A. 多胎
B. 肥胖
C. 服用 Tamoxifen
D. 服用動情激素

正確答案：A. 多胎